3. Patient treated by Eribulin between January and October 2014 (for the retrospective part) or between November 2014 and September 2015 (for the prospective part).

The above is a clinical trial inclusion criterion. Annotated with entity spans:
[Parsing_Error: 3.] Patient treated by [Drug: Eribulin] [Temporal: between January and October 2014] (for the retrospective part) or [Temporal: between November 2014 and September 2015] (for the prospective part).